Provision of a signed written informed consent

The above is a clinical trial inclusion criterion. Annotated with entity spans:
[Informed_consent: Provision of a signed written informed consent]